一位 65 歲病人最近一個月疲倦、走路呼吸急促。十年前診斷腎病症候群，給予類固醇治療效果不 彰。他的血清肌酸酐五年前為 2.8 mg/dL，兩年前上升至 5.2 mg/dL；此次檢查為 9.5 mg/dL，BUN 
 120 mg/dL，血紅素 8.5 g/dL，電解質：Na 139 mmol/L，K 5.8 mmol/L，Cl 103 mmol/L，Ca 7.8 mg/dL， 0 mg/dL。有關此病人的處置下列何者較不適當？
A. 給予 erythropoietin 注射
B. 病人副甲狀腺素濃度通常會上升，可先用CaCO3控制磷離子
C. 可考慮給予血管張力素第一型受體抑制劑（angiotensin type I receptor blocker）減緩腎功能衰退
D. 可考慮開始透析治療

正確答案：C. 可考慮給予血管張力素第一型受體抑制劑（angiotensin type I receptor blocker）減緩腎功能衰退